Ante un paciente de 23 años que acude a urgencias un viernes de madrugada tras una pelea callejera, con signos claros de enolismo y lesión por arma blanca (apuñalado) a nivel de III espacio intercostal derecho a 3 mm del margen esternal sangrando activamente y hemodinámicamente inestable asociado a hipofonesis marcada de todo hemitórax derecho. ¿Qué estructura de las siguientes debe pensar que puede estar lesionada?
1. Arteria carótida primitiva derecha.
2. Arteria torácica interna derecha.
3. Arteria subescapular derecha.
4. Arteria tiroidea superior derecha.
5. Arteria tímica superior derecha.

Respuesta correcta: 2. Arteria torácica interna derecha.